Clinical trial inclusion criterion:
HCV naive

Entity relations:
- Has_value("HCV", "naive")
- multi("HCV naive", "HCV")